Clinical trial inclusion criterion:
9. Understanding of study procedures

Annotated entities:
- Non-query-able: "Understanding of study procedures"
- Post-eligibility: "Understanding of study procedures"